An average defecation frequency (DF) of <3 per week based on a 3-week defecation diary (patient-reported)

The above is a clinical trial inclusion criterion. Annotated with entity spans:
An [Measurement: average defecation frequency] ([Measurement: DF]) of [Value: <3 per week] based on a [Procedure: 3-week defecation diary] ([Qualifier: patient-reported])